Clinical trial exclusion criterion:
Received any experimental drugs or devices within 30 days or 5 half lives, whichever is longer, prior to dosing.

Annotated entities:
- Drug: "experimental drugs"
- Device: "experimental devices"
- Temporal: "within 30 days"
- Temporal: "within 5 half lives"
- Context_Error: "experimental drugs or devices within 30 days or 5 half lives"
- Non-query-able: "experimental drugs or devices within 30 days or 5 half lives"